D-glucose是還原糖（reducing sugar），其anomeric carbon可被氧化，下列何者為其氧化產物？
A. dextrose
B. D-sorbitol
C. D-gluconic acid
D. D-glucuronic acid

正確答案：C. D-gluconic acid